Clinical trial exclusion criterion:
History of intolerance to colchicine

Entity relations:
- AND("intolerance", "colchicine")